Clinical trial exclusion criterion:
current diagnosis of a mood, anxiety, or other disorder that is more clinically salient than PTSD

Annotated entities:
- Condition: "mood disorder"
- Condition: "anxiety disorder"
- Condition: "disorder"
- Qualifier: "other"
- Condition: "PTSD"
- Qualifier: "more clinically salient than PTSD"